一位40歲亞裔女性病人，沒有抽菸史，最近被診斷為非小細胞肺癌第四期，腫瘤有EGFR基因突變，下面何種治療較為合適？
A. EGFR 抑制劑
B. EGFR 抑制劑+化學治療
C. 抑制血管增生抗體
D. EGFR 抑制劑+抑制 血管增生抗體

正確答案：A. EGFR 抑制劑